Thrombosis in left atrium;

The above is a clinical trial exclusion criterion. Annotated with entity spans:
[Condition: Thrombosis] in [Qualifier: left atrium];